De un tejido al que se le añade un desacoplador de la cadena transportadora de electronescabe esperar que:
1. Consuma oxígeno y no produzca ATP.
2. No consuma oxígeno y produzca ATP.
3. Ni consuma oxígeno ni produzca ATP.
4. Incremente la producción de ATP.

Respuesta correcta: 1. Consuma oxígeno y no produzca ATP.